Subject requires uni or bilateral facetectomy to treat leg/back pain.

The above is a clinical trial exclusion criterion. Annotated with entity spans:
Subject requires [Qualifier: uni] or [Qualifier: bilateral] [Procedure: facetectomy] to treat leg/[Condition: back pain].